Lack a mobile phone and/or unable to return for follow-up clinic visits during the next 24 months

The above is a clinical trial exclusion criterion. Annotated with entity spans:
[Post-eligibility: Lack a mobile phone and/or unable to return for follow-up clinic visits during the next 24 months]